一位27歲男性氣喘患者，常有氣喘急性發作，下列何種檢查對於偵測此患者病情之變化最簡單有效？
A. 痰之嗜伊紅性白血球細胞數
B. 免疫球蛋白E（IgE）之檢查
C. FEV1/FVC
D. 自行使用尖峰呼氣流速（PEFR）之檢查

正確答案：D. 自行使用尖峰呼氣流速（PEFR）之檢查